Poor health literacy

The above is a clinical trial exclusion criterion. Annotated with entity spans:
[Observation: Poor health literacy]